關於脊椎的爆裂性骨折（burst fracture）之敘述，下列何者正確？
A. 發生機轉與脊椎的Chance氏骨折相同
B. 容易發生在骨質疏鬆症的病人
C. 脊椎體塌陷大於50%為不穩定骨折
D. 與脊椎的壓迫性骨折（compression fracture）相比，較少發生神經損傷

正確答案：C. 脊椎體塌陷大於50%為不穩定骨折